Clinical trial exclusion criterion:
Receiving drugs acting primarily on the central nervous system, which lower the seizure threshold such as antipsychotic drugs (chlorpromazine, clozapine) or tricyclic antidepressants.

Annotated entities:
- Drug: "drugs acting primarily on the central nervous system"
- Qualifier: "lower the seizure threshold"
- Drug: "antipsychotic drugs"
- Drug: "chlorpromazine"
- Drug: "clozapine"
- Drug: "tricyclic antidepressants"